contraindication to spinal anaesthesia

The above is a clinical trial exclusion criterion. Annotated with entity spans:
[Condition: contraindication] to [Procedure: spinal anaesthesia]